Clinical trial exclusion criterion:
the history of severe inoculation allergies

Entity relations:
- Has_qualifier("inoculation allergies", "severe")
- Has_temporal("inoculation allergies", "history")